8. A major surgical procedure, or significant traumatic injury ≤28 days of beginning treatment, or anticipation of the need for major surgery during the course of the study.

The above is a clinical trial exclusion criterion. Annotated with entity spans:
8. A [Qualifier: major] [Procedure: surgical procedure], or [Qualifier: significant] [Condition: traumatic injury] [Temporal: ≤28 days of beginning treatment], or anticipation of the [Mood: need for] [Procedure: major surgery] [Temporal: during the course of the study].